Clinical trial exclusion criterion:
Death expected within the next 48 h (moribund patients as defined by ASA = class V)

Entity relations:
- Has_temporal("Death expected", "within the next 48 h")
- Has_value("ASA", "= class V")
- Subsumes("moribund", "ASA")
- Subsumes("Death expected", "moribund")